右肺門（hilum）正上方的溝（或壓跡）是由何結構造成的？
A. 食道
B. 動脈弓
C. 奇靜脈
D. 上腔靜脈

正確答案：C. 奇靜脈